Clinical trial inclusion criterion:
Kellgren-Lawrence grade I-III

Annotated entities:
- Measurement: "Kellgren-Lawrence grade"
- Value: "I-III"